Subjects with a supine BP >140 mm Hg systolic or >90 mm Hg diastolic or <100 mm Hg systolic or <60 mm Hg diastolic based on the average of the triplicate

The above is a clinical trial exclusion criterion. Annotated with entity spans:
Subjects with a [Measurement: supine BP] [Value: >140 mm Hg systolic] or [Value: >90 mm Hg diastolic] or [Value: <100 mm Hg systolic] or [Value: <60 mm Hg diastolic] based on the average of the triplicate